A. C. está hospitalizada por presentar un cuadro de tirotoxicosis. ¿Cuál de estas medidas llevaría a cabo?
1. Abrigar a la paciente con mantas.
2. Proporcionar dieta hipocalórica.
3. Animar a que realice ejercicio físico aeróbico.
4. Controlar la frecuencia y características del pulso.
5. Administrar ablandadores de heces con regularidad.

Respuesta correcta: 4. Controlar la frecuencia y características del pulso.